Clinical trial exclusion criterion:
6. Grade 2 or higher peripheral ischemia, except for brief (< 24 hrs) episodes of ischemia managed non-surgically and without permanent deficit.

Annotated entities:
- Parsing_Error: "6."
- Condition: "peripheral ischemia"
- Qualifier: "Grade 2 or higher"
- Value: "2 or higher"
- Temporal: "brief"
- Value: "< 24 hrs"
- Condition: "ischemia"
- Procedure: "surgically"
- Negation: "non"
- Condition: "permanent deficit"
- Negation: "without"
- Negation: "except"